sterile male partners

The above is a clinical trial inclusion criterion. Annotated with entity spans:
[Non-query-able: sterile male partners]